下列何種顱縫早閉（craniosynostosis )最常見？
A. 人狀縫骨縫早閉（lambdoid synostosis）
B. 冠狀縫骨縫早閉（coronal synostosis）
C. 矢狀縫骨縫早閉（isolated sagittal synostosis）
D. 額骨骨縫早閉（metopic synostosis）

正確答案：C. 矢狀縫骨縫早閉（isolated sagittal synostosis）